Clinical trial inclusion criterion:
T-score according to DXA: <-2.5

Annotated entities:
- Measurement: "T-score"
- Procedure: "DXA"
- Qualifier: "according to DXA"
- Value: "<-2.5"